Overweight / obesity diagnostic criteria according to WHO-WPR

The above is a clinical trial inclusion criterion. Annotated with entity spans:
[Condition: Overweight] / [Condition: obesity] diagnostic criteria according to [Qualifier: WHO-WPR]